Clinical trial exclusion criterion:
Suspected or known gynecological malignancy.

Annotated entities:
- Condition: "gynecological malignancy"
- Mood: "Suspected"
- Mood: "known"